Which models are used for predicting disease progression in Duchenne Muscular Dystrophy?

Longitudinal changes in biomarkers were modeled with a cumulative distribution function using a nonlinear mixed-effects approach. Longitudinal progression of Duchenne Muscular Dystrophy was also modeled using a weighted average probability method. Duchenne muscular dystrophy disease progression was modeled using the following models: linear progression function, logarithmological, multisubunit, linear multiple-parametry, and linear multiple sum